Clinical trial exclusion criterion:
Systemic administration of corticosteroids (PO/IV/IM) within 90 days prior to informed consent.

Annotated entities:
- Qualifier: "Systemic administration"
- Drug: "corticosteroids"
- Qualifier: "PO"
- Qualifier: "IV"
- Qualifier: "IM"
- Temporal: "within 90 days prior to informed consent"
- Reference_point: "informed consent"